Clinical trial exclusion criterion:
Patient with an esophageal location of scleroderma

Annotated entities:
- Qualifier: "esophageal location"
- Condition: "scleroderma"